Which type of pluripotency is Otx2 associated with?

Otx2 is an intrinsic determinant of the embryonic stem cell state and is required to stabilize the EpiSC state by suppressing the mesendoderm-to-neural fate switch.